Entre las reacciones parciales que conducen al carbonato de sodio por el Proceso Solvay, se encuentran:
1. La reacción entre el carbonato de calcio y el cloruro de sodio.
2. La precipitación de hidrogenocarbonato de sodio.
3. La descomposición térmica del cloruro amónico.
4. La formación de CaCO3 a partir de CaO y CO2.
5. La reacción del amoniaco con el óxido de calcio.

Respuesta correcta: 2. La precipitación de hidrogenocarbonato de sodio.